a chronic use of non-steroidal anti-inflammatory drugs, (NSAID)

The above is a clinical trial exclusion criterion. Annotated with entity spans:
a [Condition: chronic use] of [Drug: non-steroidal anti-inflammatory drugs], ([Drug: NSAID])